Clinical trial inclusion criteria:
adult patients
ASA class 1 to 3 patients
patients scheduled for elective breast mastectomy or quadrantectomy

Annotated entities:
- Person: "adult"
- Measurement: "ASA class"
- Value: "1 to 3"
- Qualifier: "elective"
- Procedure: "mastectomy"
- Procedure: "breast quadrantectomy"